Clinical trial exclusion criterion:
allergy to to local anesthetics

Annotated entities:
- Condition: "allergy"
- Drug: "local anesthetics"